What drug treatment can cause a spinal epidural hematoma?

Spinal epidural hematoma (SEH) is a rare disease that causes cord compression and neurologic deficit.pinal subdural hematoma associated with antiplatelet therapy